Clinical trial exclusion criteria:
age less than 13 years at time of procedure
use of pain medication prior to procedure
pectus carinatum, Poland's syndrome, or any chest wall anomaly other than pectus excavatum
previous repair of pectus excavatum by any technique
previous thoracic surgery
congenital heart disease
bleeding dyscrasia
major anesthetic risk factors or history of previous problem with anesthesia
pregnancy
inability to communicate in English

Annotated entities:
- Person: "age"
- Value: "less than 13 years"
- Temporal: "at time of procedure"
- Drug: "pain medication"
- Temporal: "prior to procedure"
- Condition: "pectus carinatum"
- Condition: "Poland's syndrome"
- Condition: "chest wall anomaly"
- Negation: "other than"
- Condition: "pectus excavatum"
- Procedure: "repair of pectus excavatum"
- Temporal: "previous"
- Temporal: "previous"
- Procedure: "thoracic surgery"
- Condition: "congenital heart disease"
- Condition: "bleeding dyscrasia"
- Condition: "anesthetic risk factors"
- Qualifier: "major"
- Condition: "problem with anesthesia"
- Temporal: "previous"
- Condition: "pregnancy"
- Condition: "inability to communicate in English"